Clinical trial inclusion criteria:
type 2 diabetic, age 18 and over, informed consent,

Annotated entities:
- Condition: "type 2 diabetic"
- Person: "age"
- Value: "18 and over"
- Informed_consent: "informed consent"